Clinical trial exclusion criterion:
i. Warfarin, phenprocoumon: increase bleeding tendency ii. Increase blood concentration of phenytoin iii. sorivudine: inhibit DPD -> increase toxicity according to fluoropyrimidine iv. allopurinol : decrease activity of S-1

Annotated entities:
- Drug: "Warfarin"
- Drug: "phenprocoumon"
- Measurement: "bleeding tendency"
- Measurement: "blood concentration of phenytoin"
- Value: "Increase"
- Drug: "sorivudine"
- Drug: "allopurinol"
- Value: "increase"
- Drug: "fluoropyrimidine"
- Non-representable: "increase bleeding tendency"
- Non-representable: "Increase blood concentration of phenytoin"